關於肝細胞癌（hepatocellular carcinoma），下列何者錯誤？
A. 分為多發性結節型、單獨結節腫塊型和浸潤型
B. 以多發性結節最常見
C. 不適合手術治療之肝癌，可藉由其他方法，如肝動脈栓塞法（TAE）治療
D. 接受肝動脈栓塞法（TAE）治療之患者，其肝功能不宜太差，且其門靜脈血流最好暢通

正確答案：B. 以多發性結節最常見